¿Cuál es el factor, entre los siguientes, que ha mostrado una mayor capacidad de predecir un trastorno bipolar?:
1. Tener un trastorno de personalidad grave.
2. Tener menos de 24 años y ser varón.
3. Embarazo.
4. Consumo de alcohol y /o sustancias.
5. Tener antecedentes familiares de haber padecido el trastorno.

Respuesta correcta: 5. Tener antecedentes familiares de haber padecido el trastorno.